一位18歲男性因為8小時前開始腹痛而來急診，伴隨有些微噁心症狀，食慾不佳（anorexia），無發燒。腹部疼痛的位置原本在肚臍周圍（periumbilical area），到醫院時發現轉移到右下腹部。理學檢查發現腸音稍慢，右下腹有壓痛（tenderness），無反彈痛（rebound tenderness），有腰大肌徵象（psoas sign）。依 目前的研究證據，你認為那一項症狀或徵象對於懷疑闌尾炎的敏感度（sensitivity）最高？
A. 腰大肌徵象（psoas sign）
B. 轉移痛（migration pain）
C. 右下腹痛（right lower quadrant pain）
D. 發燒（fever）

正確答案：C. 右下腹痛（right lower quadrant pain）